Clinical trial inclusion criterion:
Patients will be included if they are having an in-patient spinal fusion procedure, are 18 years or older, post and post-operative pain control plan includes opioid medications.

Entity relations:
- AND("spinal fusion procedure", "in-patient")
- Has_value("years", "18 years or older")
- AND("pain control plan", "opioid")
- Has_temporal("pain control plan", "post-operative")